Clinical trial exclusion criterion:
Has received ECT or MECT within 3 months prior to screening.

Annotated entities:
- Temporal: "within 3 months prior to screening"
- Reference_point: "screening"
- Procedure: "ECT"
- Procedure: "MECT"